Clinical trial exclusion criterion:
Pregnancy or lactation.

Annotated entities:
- Condition: "lactation"
- Condition: "Pregnancy"